What gene is mutated in Sickle Cell Anemia?

sca patients present clinical and hematologic variability that cannot be only explained by the single mutation in the beta-globin gene.